78歲男性因腦中風無法行動，住在長期照護機構，最近被發現其左後腳跟有一約1 cm之紅斑及瘀傷。下列有關處理此一壓瘡 （pressure ulcer）之敘述何者最適當？
A. 進行全層皮膚移植（full-thickness skin graft）
B. 進行擴創（debridement）並以優碘清洗
C. 以泡沫軟墊保護腳跟，避免進一步傷害
D. 將左腳抬高30度

正確答案：C. 以泡沫軟墊保護腳跟，避免進一步傷害